Clinical trial inclusion criteria:
ADHD

Annotated entities:
- Condition: "ADHD"